Clinical trial exclusion criterion:
Patients with clinically symptomatic brain metastases

Annotated entities:
- Observation: "clinically symptomatic"
- Condition: "brain metastases"